¿Cuál de los siguientes se considera un predictor de mala respuesta al tratamiento de exposición en el Trastorno de Estrés Postraumático?:
1. Sentimientos de ira o culpa.
2. Miedo intenso.
3. Abusos sexuales.
4. Insomnio severo.

Respuesta correcta: 1. Sentimientos de ira o culpa.